Oxygen therapy: Subjects receiving treatment with long-term oxygen therapy (LTOT) or nocturnal oxygen therapy required for greater than 12 hours a day. Oxygen prn use (i.e. <=12 hours per day) is not exclusionary.

The above is a clinical trial exclusion criterion. Annotated with entity spans:
Oxygen therapy: Subjects receiving treatment with [Procedure: long-term oxygen therapy (LTOT)] or [Procedure: nocturnal oxygen therapy] required for [Multiplier: greater than 12 hours a day]. [Grammar_Error: Oxygen prn use (i.e. <=12 hours per day) is not exclusionary.]